關於食道弛緩不能（esophageal achalasia）的外科手術，下列何者正確？①可經由開胸與開腹手術施行 ②大部分必須施行食道切除與重建手術才能解決吞嚥困難的問題 ③下食道括約肌的肌肉切開術是最常使用的方法 ④胃底折疊手術 （fundoplication） 有助於減少術後胃液逆流的產生
A. ①②③
B. ①②④
C. ②③④
D. ①③④

正確答案：D. ①③④